Bleeding diathesis

The above is a clinical trial exclusion criterion. Annotated with entity spans:
[Condition: Bleeding diathesis]